4. Previously participated in any HIV vaccine study

The above is a clinical trial exclusion criterion. Annotated with entity spans:
4. [Context_Error: Previously participated in any HIV vaccine study]